Clinical trial inclusion criterion:
Human epidermal growth factor receptor 2 (HER2)-positive.

Annotated entities:
- Measurement: "Human epidermal growth factor receptor 2 (HER2)"
- Value: "positive"